雄性素（androgen）可在胎兒的那 2 個器官生成？
A. 肺及肝
B. 肝及腎上腺
C. 腎上腺及胃
D. 胃及肺

正確答案：B. 肝及腎上腺